List search engines used in proteomics.

Mascot
X!Tandem
MS-GF
MS Amanda 
MyriMatch
Comet
Tide
Andromeda
OMSSA